Clinical trial exclusion criterion:
Patient is hemodynamically unstable on POD 15

Entity relations:
- AND("POD 15", "hemodynamically unstable")